Clinical trial exclusion criterion:
Participant has a history of epilepsy or fits or unexplained black-outs other than vasovagal collapse

Annotated entities:
- Condition: "epilepsy"
- Condition: "fits"
- Condition: "black-outs"
- Qualifier: "unexplained"
- Condition: "vasovagal collapse"
- Negation: "other than"
- Temporal: "history"